Clinical trial exclusion criterion:
5. Hemoglobin < 10 g/dL

Entity relations:
- Has_value("Hemoglobin", "< 10 g/dL")